diabetes mellitus type 1

The above is a clinical trial inclusion criterion. Annotated with entity spans:
[Condition: diabetes mellitus type 1]